Clinical trial exclusion criterion:
ALL as secondary malignancy

Entity relations:
- Has_qualifier("malignancy", "secondary")
- Subsumes("ALL", "malignancy")